Patients who have Tacrolimus trough level resulted as 2 ng/mg at the baseline.

The above is a clinical trial exclusion criterion. Annotated with entity spans:
Patients who have [Measurement: Tacrolimus] trough level resulted as [Value: 2 ng/mg] at the baseline.